Infectious pathologies evoluting and requiring antibiotherapy.

The above is a clinical trial exclusion criterion. Annotated with entity spans:
[Condition: Infectious pathologies] [Qualifier: evoluting] and [Qualifier: requiring antibiotherapy].